ECOG performance status of 0-2

The above is a clinical trial inclusion criterion. Annotated with entity spans:
[Measurement: ECOG performance status] of [Value: 0-2]